髖關節前位脫位，患肢髖部產生何種畸形？
A. 外展（abduction）及外旋轉（external rotation）
B. 外展及內旋轉（internal rotation）
C. 內收（adduction）及內旋轉
D. 內收及外旋轉

正確答案：A. 外展（abduction）及外旋轉（external rotation）